What is the function of a protein degron?

Protein degrons are artificial short peptides which specifically bind to defined functional domains, track, and inhibit a given target molecule with high affinity and specificity. They represent a remarkable alternative to antibodies in many applications.